Active substance dependency

The above is a clinical trial exclusion criterion. Annotated with entity spans:
Active [Condition: substance dependency]